Clinical trial exclusion criteria:
Type 1 diabetes
Treatment with insulin
Body weight > 140 kg
HbA1c > 75 mmol/mol
Treatment with GLP-1 analogues, Dipeptidyl peptidase-4 inhibitors, or glitazones
Chronic kidney disease
Hepatic disease
Pancreatitis
Inflammatory bowel disease
Osteoporosis
Family or personal history of medullary thyroid carcinoma
Treatment with glucocorticoids
Hormone replacement therapy
Diabetic gastroparesis
Pregnancy or lactation

Annotated entities:
- Condition: "Type 1 diabetes"
- Drug: "insulin"
- Procedure: "Treatment"
- Measurement: "Body weight"
- Value: "> 140 kg"
- Measurement: "HbA1c"
- Value: "> 75 mmol/mol"
- Drug: "GLP-1 analogues"
- Drug: "Dipeptidyl peptidase-4 inhibitors"
- Drug: "glitazones"
- Condition: "Chronic kidney disease"
- Condition: "Hepatic disease"
- Condition: "Pancreatitis"
- Condition: "Inflammatory bowel disease"
- Condition: "Osteoporosis"
- Condition: "medullary thyroid carcinoma"
- Temporal: "personal history"
- Observation: "Family"
- Drug: "glucocorticoids"
- Procedure: "Treatment"
- Procedure: "Hormone replacement therapy"
- Condition: "Diabetic gastroparesis"
- Condition: "Pregnancy"
- Condition: "lactation"